下列有關外陰部乳房外柏哲德氏病（extramammary Paget disease）的敘述， 何者較不正確？
A. 此罕見病灶的臨床表徵與乳房的柏哲德氏病相似
B. 與乳頭的柏哲德氏病相同，外陰部乳房外柏哲德氏病大多數有伴隨的潛在侵襲癌
C. 該疾病的腫瘤細胞-柏哲德氏細胞（Paget cell）常常表現cytokeratin 7
D. 柏哲德氏細胞可能向周邊上皮蔓延，超越外觀上肉眼可以辨識的區域，所以有時無法將病灶完全切除而導致復發

正確答案：B. 與乳頭的柏哲德氏病相同，外陰部乳房外柏哲德氏病大多數有伴隨的潛在侵襲癌